Clinical trial inclusion criterion:
Not diagnosed with Type 2 diabetes.

Annotated entities:
- Negation: "Not"
- Condition: "Type 2 diabetes"